一位 34 歲女性，因為在家中昏迷不醒，被送至醫院急診，理學檢查發現 Glasgow 昏迷指數為：眼反應 1 分，運動反應 4 分，語言反應 1 分，兩側瞳孔等大，直徑 3 公釐，右側光反射不明顯，左側 Babinski sign 呈陽性反應，頭部及四肢無明顯外傷或瘀青。詢問病史得知病人無高血壓或心臟病，沒有跌倒的病史，急診醫師馬上作處置，最重要之第一個處置為何？
A. 頭部電腦斷層檢查
B. 頭部核磁共振檢查
C. 會診神經內、外科醫師
D. 建立呼吸通道以及穩定循環系統

正確答案：D. 建立呼吸通道以及穩定循環系統